the abnormality of 4 levels (local, systemic adverse reactions and vital signs) was judged to be related to vaccination

The above is a clinical trial exclusion criterion. Annotated with entity spans:
[Non-representable: the abnormality of 4 levels (local, systemic adverse reactions and vital signs) was judged to be related to vaccination]